35 歲女性已口服避孕藥避孕 5 年，因為右上腹不適而至門診就診，經腹部超音波檢查發現在肝臟左葉被膜下方有一 8 公分大腫瘤，顯微鏡下腫瘤內找不到門脈區但有明顯的小動脈及小靜脈的增生， 腫瘤細胞與正常肝細胞相似但具有透亮細胞質。下列關於此疾病臨床特徵之敘述，何者錯誤？
A. 臨床上不易與惡性肝細胞癌區分
B. 病人常見門脈高壓
C. 懷孕時腫瘤容易破裂造成腹腔內出血
D. 少數病例可能與肝細胞癌同時出現

正確答案：B. 病人常見門脈高壓